Clinical trial inclusion criterion:
Biological parameters at the beginning of the study: leucocytes ³ 2000 elements per mm3, hemoglobin ³ 10.5g/dl, platelets ³ 100 000 per mm3, phosphatases alcalines transaminases £ 1 time 1/2 compared to the normal.

Entity relations:
- Has_value("leucocytes", "³ 2000 elements per mm3")
- Has_value("platelets", "³ 100 000 per mm3")
- Has_value("phosphatases alcalines transaminases", "£ 1 time 1/2 compared to the normal")
- Has_index("at the beginning of the study", "the beginning of the study")
- Has_temporal("leucocytes", "at the beginning of the study")
- Has_temporal("hemoglobin", "at the beginning of the study")
- Has_temporal("³ 10.5g/dl", "at the beginning of the study")
- Has_temporal("platelets", "at the beginning of the study")
- Has_temporal("phosphatases alcalines transaminases", "at the beginning of the study")